Clinical trial inclusion criteria:
Women without PCOS as defined by the Rotterdam criteria.
Presence of at least 2 cryopreserved good quality cleavage-stage embryo (good quality cleavage-stage embryos display stage-specific cell division, have blastomeres of fairly equal size with few to no cytoplasmic fragments).

Annotated entities:
- Negation: "without"
- Condition: "PCOS"
- Qualifier: "Rotterdam criteria"
- Multiplier: "at least 2"
- Qualifier: "cryopreserved"
- Qualifier: "good quality"
- Observation: "cleavage-stage embryo"
- Qualifier: "good quality"
- Observation: "cleavage-stage embryos"
- Qualifier: "stage-specific cell division"
- Qualifier: "have blastomeres of fairly equal size"
- Qualifier: "few to no cytoplasmic fragments"